The treating physician has chosen Ventavis as a suitable long-term treatment for the patient

The above is a clinical trial inclusion criterion. Annotated with entity spans:
The treating physician has chosen [Drug: Ventavis] as a suitable [Multiplier: long-term] treatment for the patient